有一 40 歲的男性病人，主訴左下肢腫脹約 1 星期，身體診查發現左足部及小腿皆比右側來得腫大，並沒有紅腫現象，但小腿肌肉有壓痛感，作一個測試，將左足部作向後彎曲（Dorsiflexion）的動作，會引發小腿肌肉疼痛，表示很可能是左下肢深層靜脈栓塞（Deep vein thrombosis），則此測試之名稱為：
A. Kussmaul test
B. Homans' test
C. Allen's test
D. Babinski's test

正確答案：B. Homans' test